Clinical trial inclusion criterion:
The patient underwent a successful transcutaneous implant procedure for an aortic valve within the past 24 hours

Entity relations:
- AND("transcutaneous implant procedure", "aortic valve")
- Has_temporal("transcutaneous implant procedure", "past 24 hours")